27 歲女性，G2P2，姙娠 33 週，分娩早產女嬰一名，新生兒呼吸慢且不規則，依阿帕格氏計分法 （Apgar score），於呼吸之分項下得分為何？
A. 3
B. 2
C. 1
D. 0

正確答案：C. 1